下列四種癌症，在 4 歲以下兒童每百萬人口年發生率（annual incidence rate per million children）由高而低順序排列何者正確？①血癌（leukemia） ②淋巴癌（lymphoma） ③腦瘤（brain tumor） ④神經母細胞瘤（neuroblastoma）
A. ①②③④
B. ①③②④
C. ①③④②
D. ①②④③

正確答案：C. ①③④②